Clinical trial exclusion criterion:
Cases complaining of hematemesis.

Annotated entities:
- Condition: "hematemesis"